Clinical trial exclusion criterion:
The patient or his/her representative refuses to sign the consent

Annotated entities:
- Informed_consent: "The patient or his/her representative refuses to sign the consent"